How many genes are screened by the FoundationOne companion diagnostic?

FoundationOne CDx comprises a 324-gene panel.